Which are the main G1/S transcription factors in yeast?

MBF and SBF are two members of bHLH-PAS-containing family of transcription factors that represent theG1/S transcription factors in Saccharomyces cerevisiae